Clinical trial inclusion criterion:
• History of physician-diagnosed inflammatory bowel disease (IBD)

Entity relations:
- Has_temporal("inflammatory bowel disease (IBD)", "History")